2. AST or ALT > 3 × ULN

The above is a clinical trial exclusion criterion. Annotated with entity spans:
[Parsing_Error: 2.] [Measurement: AST] or [Measurement: ALT] [Value: > 3 × ULN]